Clinical trial inclusion criterion:
3. impaired glucose homeostasis (fasting plasma glucose concentration of 110 mg⁄dL or greater or glucose of 140 mg⁄dL or greater after OGTT or

Annotated entities:
- Condition: "impaired glucose homeostasis"
- Measurement: "fasting plasma glucose concentration"
- Value: "110 mg⁄dL or greater"
- Measurement: "glucose"
- Value: "140 mg⁄dL or greater"
- Procedure: "OGTT"
- Temporal: "after OGTT"
- Reference_point: "OGTT"
- Qualifier: "after OGTT"